Clinical trial inclusion criterion:
6. Ability to read and write English

Annotated entities:
- Non-query-able: "Ability to read and write English"
- Post-eligibility: "Ability to read and write English"